Hypersensitivity to the active substance, or to any of the excipients of Lemtrada®

The above is a clinical trial exclusion criterion. Annotated with entity spans:
[Condition: Hypersensitivity] to the active substance, or to any of the excipients of [Drug: Lemtrada]®